Clinical trial exclusion criterion:
Contraindication to adenosine stress test

Annotated entities:
- Procedure: "adenosine stress test"
- Condition: "Contraindication"